下列何者為傳播人畜共通萊姆病（Lyme disease）之主要病媒（vector）？
A. 硬蜱屬（Ixodes spp.）
B. 牛蜱屬（Boophilus spp.）
C. 革蜱屬（Dermacentor spp.）
D. 軟蜱屬（Ornithodoros spp.）

正確答案：A. 硬蜱屬（Ixodes spp.）